下列有關角膜上皮（corneal epithelium）的敘述，何者錯誤？
A. 具有少許血管
B. 具有少許神經纖維
C. 不會角質化（keratinize）
D. 來自外胚層

正確答案：A. 具有少許血管